有位 8 歲輕微智障之男孩，被診斷有自閉症傾向，身體檢查發現雙側睪丸較同年齡男童大，耳朵外觀正常但比同齡兒童大，語言發展也有障礙。此兒童最有可能是下列何疾病？
A. 唐氏症（Down syndrome）
B. 透納氏症（Turner syndrome）
C. 易脆型染色體 X 症候群（fragile X syndrome）
D. 苯酮酸尿症（phenylketonuria）

正確答案：C. 易脆型染色體 X 症候群（fragile X syndrome）